Which are the causes of the Koebner phenomenon?

The causes of the Koebner phenomenon are:
1) Lichen sclerosus
2) Vitiligo
3) Psoriasis and 
4) Physical stress.